Clinical trial inclusion criterion:
Inclusion/exclusion criteria

Annotated entities:
- Non-representable: "Inclusion/exclusion criteria"